Entre los predictores de un mal pronóstico en la esquizofrenia, están:
1. Síntomas positivos y surgimiento tardío.
2. No tener factores precipitantes y tener un ajuste premórbido bueno.
3. Surgimiento temprano y factores precipitantes identificables.
4. Estar casado y con mal sistema de apoyo.
5. Un ajuste premórbido malo y síntomas negativos.

Respuesta correcta: 5. Un ajuste premórbido malo y síntomas negativos.